Clinical trial exclusion criterion:
Previous enrolment in this study or treatment with an investigational drug or device under another study protocol in the past 7 days

Annotated entities:
- Competing_trial: "Previous enrolment in this study or treatment with an investigational drug or device under another study protocol in the past 7 days"